Tumors.

The above is a clinical trial exclusion criterion. Annotated with entity spans:
[Condition: Tumors].